Clinical trial exclusion criterion:
Patients criteria

Annotated entities:
- Non-representable: "Patients criteria"